Patients both sexes

The above is a clinical trial inclusion criterion. Annotated with entity spans:
Patients [Person: both sexes]